42 歲肥胖並有抽菸的女性，腹部已有橫式剖腹產疤痕，乳房是 E 罩杯。現罹患右側乳癌，要求改良式乳房全切除手術（modified radical mastectomy）後立即進行乳房重建手術。下列有幾項選擇：①帶莖橫式腹直肌肌皮瓣（pedicled transverse rectus abdominis myocutaneous（TRAM）flaps） ②游離肌肉保留腹直肌肌皮瓣（free muscle sparing TRAM flaps） ③闊背肌肌皮瓣（latissimus dorsi myocutaneous flaps） ④游離深下腹動脈穿通支皮瓣（free deep inferior epigastric artery perforator （DIEP）flaps）；下列敘述何者錯誤？
A. 帶莖橫式腹直肌肌皮瓣（pedicled TRAM flaps）是不錯的選擇，但有脂肪壞死和部分皮瓣壞死的風險
B. 曾經接受剖腹產的患者，仍可選擇游離肌肉保留腹直肌肌皮瓣（free muscle sparing TRAM flaps）和游離深下腹動脈穿通支皮瓣（free DIEP flaps）做乳房重建，但要特別注意血液循環
C. 對於乳房大而且下垂的患者，單用闊背肌肌皮瓣（latissimus dorsi myocutaneous flaps）而不加用義乳進行重建是恰當的選擇
D. 游離深下腹動脈穿通支皮瓣（free DIEP flaps）對腹部皮瓣供應處的後遺症最小

正確答案：C. 對於乳房大而且下垂的患者，單用闊背肌肌皮瓣（latissimus dorsi myocutaneous flaps）而不加用義乳進行重建是恰當的選擇